Patient with contraindication to misoprostol or vasopressin, personal history or cardiac or pulmonary disease, history of prior myomectomy

The above is a clinical trial exclusion criterion. Annotated with entity spans:
Patient with [Condition: contraindication] to [Drug: misoprostol] or [Drug: vasopressin], [Temporal: personal history] or cardiac or [Condition: pulmonary disease], [Temporal: history] of [Temporal: prior] [Procedure: myomectomy]